History of excessive alcohol use, drug abuse or significant psychiatric illness

The above is a clinical trial exclusion criterion. Annotated with entity spans:
[Temporal: History] of [Condition: excessive alcohol use], [Condition: drug abuse] or [Qualifier: significant] [Condition: psychiatric illness]